Clinical trial exclusion criterion:
History of seizure disorder or at increased risk for development of a seizure disorder including, but not limited to, complicated febrile seizure and history of significant head injury.

Annotated entities:
- Condition: "seizure disorder"
- Condition: "complicated febrile seizure"
- Condition: "head injury"